El tamoxifeno:
1. Se utiliza para el tratamiento de la diabetes tipo 2.
2. Es un inhibidor de la fosfoenolpiruvato carboxiquinasa.
3. Es un agonista del receptor de progesterona.
4. Es un antagonista del receptor de estrógenos.
5. Disminuye la sensibilidad celular a insulina.

Respuesta correcta: 4. Es un antagonista del receptor de estrógenos.